Clinical trial exclusion criterion:
Uncontrolled hypertension defined as systolic >180 mmHg or > 160 mmHg on 2 consecutive measurements or diastolic > 100 mmHg on optimal medical regimen

Entity relations:
- Has_multiplier("> 160 mmHg", "on 2 consecutive measurements")
- Has_value("systolic", ">180 mmHg")
- multi("on optimal medical regimen", "optimal medical regimen")
- Has_value("diastolic", "> 100 mmHg")
- Has_qualifier("diastolic", "on optimal medical regimen")
- AND("Uncontrolled hypertension", "systolic")
- OR(">180 mmHg", "> 160 mmHg")
- OR("systolic", "diastolic")